Which type of pluripotency is Otx2 associated with?

Otx2 is an intrinsic determinant of the embryonic stem cell state and is required to stabilize the EpiSC state by suppressing the mesendoderm-to-neural fate switch by suppressing BMP4 and FGf2. The transcription factor OTX2 acts as a negative switch in the regulation of transition from naive to primed pluripotency.